Adjuvant chemotherapy

The above is a clinical trial exclusion criterion. Annotated with entity spans:
[Procedure: Adjuvant chemotherapy]